卵子生成過程中，胚泡崩解（germinal vesicle breakdown, GVBD）現象出現，代表減數分裂的那一個階段？
A. 重新啟動減數分裂 I（meiosis I）
B. 完成減數分裂 I（meiosis I）
C. 完成減數分裂II（meiosis II）
D. 完成受精（fertilization）

正確答案：A. 重新啟動減數分裂 I（meiosis I）